Clinical trial exclusion criterion:
significant unstable medical condition or life threatening disease with anticipated survival of less than 6 months;

Entity relations:
- Has_qualifier("medical condition", "unstable")
- Has_value("anticipated survival", "less than 6 months")
- Has_context("medical condition", "anticipated survival")
- OR("medical condition", "life threatening disease")